一位 80 歲胡女士，未受過正式教育，最近因為容易忘東忘西，被家屬帶至門診評估。醫師做了下列老人心智狀態評估檢查，迷你心智狀態檢查（MMSE）得分 18 分（總分 30 分）。一分鐘後覆誦「紅色」、「快樂」、「電視」（three-item recall），三項僅答對一項，畫鐘測試（clock drawing test, CDT）， Manos 法得分 6 分（總分 10 分），下列敘述何者正確？
A. 根據 MMSE 得分判讀，胡女士有失智症
B. 臨床上還無法判讀有無失智症，需加做腦部電腦斷層檢查
C. 根據 Mini-Cog test（畫鐘測試及 three-item recall）判讀，胡女士有失智症
D. 胡女士容易忘東忘西，臨床上屬於輕度認知功能異常

正確答案：C. 根據 Mini-Cog test（畫鐘測試及 three-item recall）判讀，胡女士有失智症